Undergoing ECT for treatment of their symptoms

The above is a clinical trial inclusion criterion. Annotated with entity spans:
[Temporal: Undergoing] [Procedure: ECT] for treatment of their symptoms